Alanine aminotransferase, alkaline phosphatase and bilirubin <=1.5x upper limit of normal (ULN) (isolated bilirubin >1.5xULN is acceptable if bilirubin is fractionated and direct bilirubin <35%).

The above is a clinical trial inclusion criterion. Annotated with entity spans:
[Measurement: Alanine aminotransferase], [Measurement: alkaline phosphatase] and [Measurement: bilirubin] [Value: <=1.5x upper limit of normal (ULN)] [Grammar_Error: (isolated bilirubin >1.5xULN is acceptable if bilirubin is fractionated and direct bilirubin <35%)].